En pacientes con enfermedades hematológicas, ocasionalmente puede producirse un cuadro de "cistitis hemorrágica". Entre las múltiples etiologías de este proceso se incluyen algunos virus. ¿Cuál de los citados a continuación es el más frecuentemente implicado?
1. Poliomavirus BK.
2. Virus herpes simplex tipo 2.
3. Poxvirus.
4. Enterovirus 71.

Respuesta correcta: 1. Poliomavirus BK.